Clinical trial exclusion criterion:
3. An ulcer which shows signs of severe clinical infection, defined as pus oozing from the ulcer site

Annotated entities:
- Parsing_Error: "3."
- Condition: "pus"
- Condition: "ulcer"
- Qualifier: "shows signs of severe clinical infection"
- Subjective_judgement: "shows signs of severe clinical infection"
- Condition: "severe clinical infection"